下列有關隱翅蟲之敘述，何者錯誤？
A. 臺灣地區最常見的是褐毒隱翅蟲（Paederus fusca）
B. 隱翅蟲的毒害是由蟲體螫咬人體所致
C. 隱翅蟲素（pederin）附著皮膚後會產生緩慢痊癒的壞死性紅斑
D. 待病灶痊癒後，若未再接觸隱翅蟲素，一般不用擔心復發的問題

正確答案：B. 隱翅蟲的毒害是由蟲體螫咬人體所致